Clinical trial exclusion criterion:
Subjects with less than one year duration of Parkinson's

Entity relations:
- Has_multiplier("Parkinson's", "less than one year duration")